下列關於糖尿病視網膜病變（diabetic retinopathy）何者錯誤？
A. 漸進性的微小血管變化（microangiopathy）
B. 點狀出血、棉絮狀斑點（cotton wool spot）及視網膜新生血管皆為非增殖型糖尿病視網膜病變（Non-proliferative diabetic  	retinopathy）的眼底變化
C. 合併黃斑部水腫會造成視力喪失
D. 罹患糖尿病時間越久，併發糖尿病視網膜病變的機率越高

正確答案：B. 點狀出血、棉絮狀斑點（cotton wool spot）及視網膜新生血管皆為非增殖型糖尿病視網膜病變（Non-proliferative diabetic  	retinopathy）的眼底變化